Patients not suffering from endometrial or epithelial ovarian cancer

The above is a clinical trial exclusion criterion. Annotated with entity spans:
Patients [Negation: not] suffering from [Condition: endometrial] or [Condition: epithelial ovarian cancer]